Patients may have any of the following indications for cardiac catheterization: Thoracic pain under study. Stable chronic coronary disease. Acute myocardial infarction with ST segment elevation, not perfused (without timely reperfusion therapy) with less than 4 weeks of evolution. Acute myocardial infarction with ST-segment elevation, successful thrombolytic therapy, which will undergo drug-invasive therapy. Acute myocardial infarction without ST segment elevation. Unstable angina. Any acute coronary syndrome, to intervene non-infarct-related artery. Disease of any heart valve. Myocarditis or pericarditis. Dilated cardiomyopathy. Patients in renal or cardiac transplantation protocol for any etiology. Congenital heart disease that requires knowing the coronary anatomy prior to surgical correction.

The above is a clinical trial inclusion criterion. Annotated with entity spans:
Patients may have any of the following [Condition: indications] for [Procedure: cardiac catheterization]: [Condition: Thoracic pain] under study. [Qualifier: Stable] [Condition: chronic coronary disease]. [Condition: Acute myocardial infarction] with [Condition: ST segment elevation], not perfused ([Negation: without] [Qualifier: timely] [Procedure: reperfusion therapy]) [Temporal: with less than 4 weeks of evolution]. [Condition: Acute myocardial infarction] with [Condition: ST-segment elevation], [Qualifier: successful] [Procedure: thrombolytic therapy], which [Mood: will undergo] [Procedure: drug-invasive therapy]. [Condition: Acute myocardial infarction] [Negation: without] [Condition: ST segment elevation]. [Condition: Unstable angina]. Any [Condition: acute coronary syndrome], to [Procedure: intervene] [Qualifier: non-infarct-related] [Qualifier: artery]. [Condition: Disease] of any [Qualifier: heart valve]. [Condition: Myocarditis] or [Condition: pericarditis]. [Qualifier: Dilated] [Condition: cardiomyopathy]. Patients in [Condition: renal] or [Condition: cardiac transplantation] protocol for any etiology. [Condition: Congenital heart disease] that requires [Qualifier: knowing the coronary anatomy] [Temporal: prior to surgical correction.]